Clinical trial exclusion criteria:
taken adenosine diphosphate (ADP) receptor antagonists within 2 weeks
Platelet count <100g/L;
A history of bleeding tendency;
Aspirin, ticagrelor or clopidogrel allergies;
Severe liver injury.

Annotated entities:
- Drug: "adenosine diphosphate (ADP) receptor antagonists"
- Temporal: "within 2 weeks"
- Measurement: "Platelet count"
- Value: "<100g/L"
- Condition: "bleeding tendency"
- Temporal: "history"
- Drug: "Aspirin"
- Drug: "ticagrelor"
- Drug: "clopidogrel"
- Condition: "allergies"
- Condition: "liver injury"
- Qualifier: "Severe"